Clinical trial exclusion criterion:
Currently taking medications containing alcohol, metronidazole, isoniazid, paraldehyde, phenytoin, warfarin, or theophylline.

Entity relations:
- Has_temporal("alcohol", "Currently")
- OR("alcohol", "theophylline", "phenytoin", "paraldehyde", "isoniazid", "metronidazole", "warfarin")